Clinical trial inclusion criterion:
Arachnoid hemorrhage

Annotated entities:
- Condition: "Arachnoid hemorrhage"